¿Qué signo o síntoma NO es típico del síndrome de Guillain-Barré?
1. Parálisis facial.
2. Alteración de esfínteres.
3. Hipo o arreflexia tendinosa.
4. Debilidad muscular.
5. Disautonomía.

Respuesta correcta: 2. Alteración de esfínteres.